Entre las seis clases de enzimas definidas por la IUB están las:
1. Fosfatasas.
2. Ligasas.
3. Polimerasas.
4. Proteasas.

Respuesta correcta: 2. Ligasas.